下列有關治療巴金森氏症的藥物 Carbidopa 的描述，何者正確？
A. 會抑制單胺氧化（monoamine oxidase）B 的活性，進而減少 dopamine 的代謝作用
B. 會減少 levodopa 在周邊系統的代謝作用
C. 經常單獨使用來治療巴金森氏症的患者
D. 會通透血腦屏障（blood-brain barrier）

正確答案：B. 會減少 levodopa 在周邊系統的代謝作用